Clinical trial exclusion criterion:
patients allergic to misoprostol;

Annotated entities:
- Condition: "allergic"
- Drug: "misoprostol"